Clinical trial inclusion criterion:
The patient was receiving anti-vitamin K (AVK) treatment before percutaneous implantation of the aortic valve

Entity relations:
- Has_index("before percutaneous implantation of the aortic valve", "percutaneous implantation of the aortic valve")
- Subsumes("anti-vitamin K", "AVK")
- Has_temporal("anti-vitamin K", "before percutaneous implantation of the aortic valve")